Clinical trial exclusion criterion:
Systolic blood pressure = 180 mmHg or diastolic blood pressure = 110 mm Hg at the baseline visit.

Entity relations:
- Has_value("Systolic blood pressure", "= 180 mmHg")
- Has_value("diastolic blood pressure", "= 110 mm Hg")
- Has_temporal("Systolic blood pressure", "at the baseline visit")
- OR("Systolic blood pressure", "diastolic blood pressure")